Dentro de las anomalías congénitas de la pared abdominal están el onfalocele y la gastrosquisis. Ambas entidades son defectos de la pared. ¿En qué se diferencian?
1. El onfalocele se produce a nivel umbilical y la gastrosquisis a nivel epigástrico.
2. El defecto, en el caso de la gastrosquisis, es de mayor tamaño que el onfalocele.
3. En el onfalocele, un saco peritoneal recubre el contenido abdominal y en la gastrosquisis no.
4. El onfalocele, a diferencia de la gastrosquisis, se asocia frecuentemente con la atresia intestinal.
5. A diferencia del onfalocele, en la gastrosquisis el tratamiento quirúrgico se puede diferir.

Respuesta correcta: 3. En el onfalocele, un saco peritoneal recubre el contenido abdominal y en la gastrosquisis no.